How many Groucho-related genes (GRG) are contained in the mouse genome?

The groucho-related genes (Grg) of the mouse comprise at least four family members.